Unresectable, histologically confirmed hepatocellular carcinoma with evident disease limited to liver.

The above is a clinical trial inclusion criterion. Annotated with entity spans:
[Qualifier: Unresectable], [Measurement: histologically] [Value: confirmed] [Condition: hepatocellular carcinoma] with evident [Qualifier: disease limited to liver].